Clinical trial inclusion criterion:
uncontrolled concomitant medical conditions that may compromise to chemotherapy

Annotated entities:
- Qualifier: "uncontrolled"
- Temporal: "concomitant"
- Condition: "medical conditions that may compromise to chemotherapy"